Creatinine clearance <60mL/min

The above is a clinical trial inclusion criterion. Annotated with entity spans:
[Measurement: Creatinine clearance] [Value: <60mL/min]